Clinical trial exclusion criterion:
Currently taking more than three glucose lowering therapies

Entity relations:
- Has_multiplier("glucose lowering therapies", "more than three")